Clinical trial inclusion criterion:
Maximum one of the following SIRS criteria (* T>38 ºC or <36ºC, L>12,000 or <4000/uL, HR>90 bpm, RR<20 rpm) or CRP>15 mg/dL

Entity relations:
- Has_value("T", ">38 ºC")
- Has_value("L", ">12,000 /uL")
- Has_value("HR", ">90 bpm")
- Has_value("RR", "<20 rpm")
- Has_value("CRP", ">15 mg/dL")
- Subsumes("SIRS criteria", "T")
- Has_value("T", "<36ºC")
- Has_value("L", "<4000/uL")
- OR("SIRS criteria", "CRP")
- OR("T", "L", "HR", "RR")